¿En cuál de estos pacientes el tratamiento quirúrgico adecuado sería la realización de una gastrectomía atípica en cuña por laparoscopia sin linfadenectomía ampliada?
1. Adenocarcinoma gástrico infiltrante y ulcerado a nivel de antro-píloro.
2. Adenocarcinoma         gástrico    infiltrante subcardial.
3. Tumor del estroma gastrointestinal a nivel de cuerpo gástrico-curvatura mayor.
4. Linfoma MALT.
5. Esófago de Barrett con metaplasia intestinal y displasia.

Respuesta correcta: 3. Tumor del estroma gastrointestinal a nivel de cuerpo gástrico-curvatura mayor.